En el tratamiento cognitivo conductual de adolescentes con bulimia nerviosa (Fairburn, 1993), durante la fase de cambio alimentario:
1. Se establece una frecuencia semanal para pesarse.
2. Se introducen algunos alimentos prohibidos.
3. Se prescribe un patrón de comidas aleatorio.
4. Se desaconseja que las pacientes anoten los alimentos que ingieren.

Respuesta correcta: 1. Se establece una frecuencia semanal para pesarse.